一位 18 歲男性因性器發育不良來診，過去史無腮腺炎或睪丸炎或頭部外傷，身體檢查發現睪丸約 1.5 公分，較硬，沒有腋毛及恥毛，有男性女乳症，血液生化檢查 FSH 40 mIU/mL，LH 41 mIU/mL， Testosterone 0.7 ng/mL。則下列檢查何者具診斷性？
A. 核磁共振（腦部）
B. HCG 刺激試驗
C. 性激素刺激試驗
D. 染色體檢查

正確答案：D. 染色體檢查